Clinical trial exclusion criterion:
Creatinine clearance < 30 mL/min

Entity relations:
- Has_value("Creatinine clearance", "< 30 mL/min")